Clinical trial inclusion criterion:
Can do questionnaires

Annotated entities:
- Observation: "Can do questionnaires"